Clinical trial exclusion criterion:
The existence of scar or fibrosis area constituting =50% of total lesion area

Annotated entities:
- Measurement: "scar area"
- Measurement: "fibrosis area"
- Value: "=50% of total lesion area"